¿Cuál es el pilar fundamental en el tratamiento del cáncer de ovario?:
1. La cirugía diagnóstica y citorreductora reglada.
2. Quimioterapia sistémica.
3. Radioterapia.
4. Administración de terapia biológica.

Respuesta correcta: 1. La cirugía diagnóstica y citorreductora reglada.